21. Has any other factor which may, in the opinion of the investigator, compromise participation and/or follow-up in the study

The above is a clinical trial exclusion criterion. Annotated with entity spans:
[Parsing_Error: 21.] [Subjective_judgement: Has any other factor which may, in the opinion of the investigator, compromise participation and/or follow-up in the study]